有關社交畏懼症（social phobia）的敘述，下列何者錯誤？
A. 在流行病學的研究顯示女性多於男性
B. 最常於 30 歲開始發作
C. 心理治療合併藥物治療的療效優於單獨使用任一種治療的療效
D. 廣泛性社交畏懼症（generalized social phobia）之患者常併發畏避性人格違常（avoidant personality

正確答案：B. 最常於 30 歲開始發作